Clinical trial exclusion criterion:
Subject with any unstable medical, psychiatric, or substance abuse disorder that in the opinion of the investigator is likely to affect the subject's ability to complete the study or preclude the subject's participation in the study

Entity relations:
- Has_qualifier("medical disorder", "unstable")
- AND("likely to affect the subject's ability to complete the study", "in the opinion of the investigator")
- Has_qualifier("medical disorder", "likely to affect the subject's ability to complete the study")
- OR("medical disorder", "psychiatric disorder", "substance abuse disorder")
- OR("likely to affect the subject's ability to complete the study", "preclude the subject's participation in the study")